Clinical trial inclusion criterion:
currently on hemodialysis at a CDC dialysis unit

Annotated entities:
- Temporal: "currently"
- Procedure: "hemodialysis"
- Visit: "CDC dialysis unit"